Clinical trial exclusion criterion:
known or presumed liver or renal dysfunction

Annotated entities:
- Qualifier: "known"
- Qualifier: "presumed"
- Condition: "renal dysfunction"
- Condition: "liver dysfunction"